一位 60 歲心肌梗塞患者，於運動測試中最大心跳為每分鐘 170 次，休息時心跳為每分鐘 70 次。若採用凱爾門公式（Karvonen's method）來開立運動處方，且運動強度設為 50%，其目標心跳應為每分鐘幾次？
A. 110 次
B. 120 次
C. 130 次
D. 140 次

正確答案：B. 120 次